Renal or hepatic insufficiency

The above is a clinical trial exclusion criterion. Annotated with entity spans:
[Condition: Renal] or [Condition: hepatic insufficiency]